一名年輕病患二日前在家中吞食通樂（內含氫氧化鈉、氨水等強鹼），檢查時若發現食道中段有環狀之潰瘍且極度腫脹，病患並有發燒，胸痛及白血球增加，此時下列何者為最適宜之處置？
A. 以內視鏡繼續檢查以完整評估食道下段及胃部
B. 給予類固醇治療降低發炎程度
C. 避免穿孔感染，不應施行胃造瘻灌食（feeding gastrostomy）
D. 給予抗生素與預防胃食道逆流製劑

正確答案：D. 給予抗生素與預防胃食道逆流製劑